¿Cuál fue una de las asignaturas novedosas del Plan de Estudios de Diplomado en Enfermería de 1977?:
1. Anatomía.
2. Salud Pública.
3. Farmacología.
4. Fisiología.

Respuesta correcta: 2. Salud Pública.